Clinical trial exclusion criterion:
refusal of insulin

Entity relations:
- AND("refusal", "insulin")